What is the role of miR-193b in prostate cancer?

Overexpression of miR-193b in prostate cancer cell lines inhibited invasion and induced apoptosis.